Clinical trial exclusion criterion:
small bowel obstruction

Annotated entities:
- Condition: "small bowel obstruction"